手術中監測病人的潮氣容積末二氧化碳（ETCO2），在下列何種情況會上升？
A. 發生空氣栓塞（air embolism）
B. 惡性高熱症（malignant hyperthermia）
C. 低體溫
D. 血壓降低

正確答案：B. 惡性高熱症（malignant hyperthermia）